Inability to comply with protocol required procedures.

The above is a clinical trial exclusion criterion. Annotated with entity spans:
[Condition: Inability to comply with protocol required procedures.]